毛地黃（digitalis）不可和 thiazides 併用，原因是 thiazide 會：
A. 產生低血鉀
B. 產生低血糖
C. 增加毛地黃之蓄積
D. 減低毛地黃的藥效

正確答案：A. 產生低血鉀